有關兔唇顎裂（cleft lip and palate）的敘述，下列何者錯誤？
A. 兔唇顎裂是最常見的顏面先天異常（anomaly）
B. 發生的原因有家族病史傾向，跟懷孕期間使用藥物、感染或吸菸也有關
C. 嚴重完整型唇顎裂（complete cleft lip/palate）可能導致吸入性肺炎，所以應該提早於3～6周進行手術
D. 顎裂矯正手術的併發症最常見的是瘻管（fistula），其次是無法完全矯正語言發音和腭咽不全

正確答案：C. 嚴重完整型唇顎裂（complete cleft lip/palate）可能導致吸入性肺炎，所以應該提早於3～6周進行手術